下列何者為限制性肺部疾病（restrictive lung diseases）之最主要特徵？
A. 肺順應性（lung compliance）減少
B. 呼吸道阻力（airway resistance）增加
C. 功能性肺餘容量（functional residual capacity）增加
D. 第一秒用力呼氣容積／用力肺活量（FEV1/FVC）＜80%

正確答案：A. 肺順應性（lung compliance）減少